Clinical trial exclusion criterion:
Subject who is illiterate or unable to understand the Informed Consent Form, questionnaires or subject diary

Annotated entities:
- Observation: "illiterate"
- Negation: "unable to"
- Informed_consent: "understand the Informed Consent Form"
- Informed_consent: "understand the subject diary"
- Informed_consent: "understand the questionnaires"